Clinical trial exclusion criterion:
Subjects legal or mentally disabled to give an informed consent for participating on this study

Annotated entities:
- Condition: "mentally disabled"
- Condition: "legal disabled"
- Informed_consent: "Subjects legal or mentally disabled to give an informed consent for participating on this study"